En relación con la estructura de los genomas, los intrones :
1. Se presentan frecuentemente en los genomas procarióticos.
2. Puede haber varios en un mismo gen.
3. Codifican aminoácidos raros en las proteínas.
4. Son transcritos y traducidos.
5. Tienen un alto contenido en pares G:C.

Respuesta correcta: 2. Puede haber varios en un mismo gen.